6 歲女童因喉嚨劇烈疼痛、吞嚥疼痛、發燒三日、呼吸困難至急診，經診視病童後，發現口水外流、呼吸有嘯鳴聲（stridor），急診科醫師安排頸部 X 光片顯示有"thumb sign＂並會診耳鼻喉科醫師，請問最可能的診斷為何？
A. 哮吼（croup）
B. 急性會厭炎（acute epiglottitis）
C. 急性咽喉炎（acute pharyngolaryngitis）
D. 急性支氣管炎（acute bronchitis）

正確答案：B. 急性會厭炎（acute epiglottitis）